Total back pain as measured by visual analog scale (VAS) = 40 mm (0-100 mm) at baseline

The above is a clinical trial inclusion criterion. Annotated with entity spans:
[Condition: Total back pain] as measured by [Measurement: visual analog scale (VAS)] [Value: = 40 mm] (0-100 mm) [Temporal: at baseline]